¿La implantación del óvulo fertilizado en un lugar distinto al endometrio uterino, se denomina?
1. Mola hidatiforme.
2. Aborto séptico.
3. Placenta previa.
4. Embarazo ectópico.
5. Abrutio placentae.

Respuesta correcta: 4. Embarazo ectópico.